Clinical trial exclusion criterion:
Patients with psychiatric disorders that would interfere with consent or follow-up. Pregnant or lactating women. Men and women of reproductive potential may not participate unless they have agreed to use an effective contraceptive method.

Annotated entities:
- Condition: "psychiatric disorders"
- Qualifier: "interfere with consent"
- Qualifier: "interfere with follow-up"
- Condition: "Pregnant"
- Condition: "lactating"
- Person: "women"
- Condition: "reproductive potential"
- Procedure: "effective contraceptive method"